Clinical trial exclusion criterion:
Known or suspected HIV, Hepatitis B, or Hepatitis C infection

Entity relations:
- OR("HIV infection", "Hepatitis B infection", "Hepatitis C infection")